8. Upon pelvic/speculum examination and colposcopy at the time of enrollment, the cervix and vagina appear normal as determined by the investigator

The above is a clinical trial inclusion criterion. Annotated with entity spans:
8. Upon [Procedure: pelvic]/[Procedure: speculum examination] and [Procedure: colposcopy] [Temporal: at the time of enrollment], the [Observation: cervix] and [Observation: vagina] appear [Value: normal] [Subjective_judgement: as determined by the investigator]